Clinical trial exclusion criterion:
Lactose intolerance

Entity relations:
- AND("intolerance", "Lactose")
- multi("Lactose intolerance", "intolerance")